Clinical trial exclusion criterion:
Has had a malignancy within 5 years before screening (exceptions are squamous and basal cell carcinomas of the skin and carcinoma in situ of cervix that has been surgically cured)

Entity relations:
- Has_temporal("malignancy", "within 5 years before screening")
- Has_index("within 5 years before screening", "screening")
- Has_qualifier("carcinoma in situ", "cervix")
- multi("surgically cured", "surgically")
- Has_qualifier("carcinoma in situ", "surgically cured")
- Has_negation("squamous carcinomas of the skin", "exceptions")
- AND("malignancy", "squamous carcinomas of the skin")
- OR("squamous carcinomas of the skin", "basal cell carcinomas of the skin", "carcinoma in situ")